Clinical trial exclusion criterion:
The patients have active infections that were not suitable for chemotherapy;

Annotated entities:
- Temporal: "active"
- Condition: "infections"
- Negation: "not"
- Qualifier: "suitable for chemotherapy"